Clinical trial exclusion criterion:
Other contraindication to cetirizine

Annotated entities:
- Condition: "contraindication"
- Drug: "cetirizine"